Clinical trial exclusion criterion:
uncontrolled intercurrent illness

Entity relations:
- Has_qualifier("intercurrent illness", "uncontrolled")